Junto a la Terapia Cognitiva Conductual ¿qué otra aproximación terapéutica ha mostrado consistentemente ser un tratamiento eficaz para la bulimia nerviosa?:
1. La psicoterapia interpersonal.
2. La terapia de mentalización.
3. La terapia de exposición en imaginación.
4. La economía de fichas.
5. La terapia de esquemas.

Respuesta correcta: 1. La psicoterapia interpersonal.